Transfer of patient to Riley Hospital for Children prior to any abdominal surgery

The above is a clinical trial inclusion criterion. Annotated with entity spans:
[Procedure: Transfer] of patient to [Visit: Riley Hospital for Children] [Temporal: prior to any abdominal surgery]